Clinical trial exclusion criterion:
Hypersensibility to toxin or excipients

Entity relations:
- AND("Hypersensibility", "toxin")
- OR("toxin", "excipients")